The Shingrix vaccine is used to prevent what disease?

Shingrix vaccine is used for prevention of herpes zoster.